視神經孔（Foramen optica）位於眼窩之何塊骨頭上？
A. 額骨（Os frontale）
B. 蝶骨（Os sphenoidale）
C. 篩骨（Os ethmoidale）
D. 腭骨（Os palatinum）

正確答案：B. 蝶骨（Os sphenoidale）